Subjects with contraindications to participation in an exercise training program

The above is a clinical trial exclusion criterion. Annotated with entity spans:
Subjects with [Condition: contraindications] to [Observation: participation in an exercise training program]